有關不同CD4+ T細胞亞群（subset）的功能，下列敘述何者錯誤？
A. 第一型輔助性T細胞（TH1）不會幫助巨噬細胞活化，及抗體之產生
B. 第二型輔助性T細胞（TH2）主要幫助B細胞產生抗體，以及幫助寄生蟲之清除
C. 調節性T細胞可藉由抑制抗原呈現細胞之功能，來抑制免疫反應之強度
D. 第十七型輔助性T細胞（TH17）會藉由幫助嗜中性白血球的趨化與活化，來控制早期的感染

正確答案：A. 第一型輔助性T細胞（TH1）不會幫助巨噬細胞活化，及抗體之產生